Clinical trial exclusion criterion:
patient with severe renal failure;

Annotated entities:
- Condition: "renal failure"
- Qualifier: "severe"